腎上腺（adrenal gland）的那一部位，在出生三年後方可辨識？
A. 髓部（medulla）
B. 網狀帶（zona reticularis）
C. 球狀帶（zona glomerulosa）
D. 束狀帶（zona fasciculata）

正確答案：B. 網狀帶（zona reticularis）